下列有關胰臟β細胞分泌胰島素主要機轉的敘述，何者正確？
A. 血中葡萄糖是經由第四型葡萄糖轉運蛋白進入胰臟β細胞刺激胰島素分泌
B. ATP敏感性的鉀離子通道打開造成鉀離子的外流是促進胰島素分泌的重要步驟
C. 血中的胺基酸會經由增加β細胞內的cAMP濃度促進胰島素的分泌作用
D. β細胞內鈣離子的濃度升高與胰島素從分泌囊泡中釋放的作用有關

正確答案：D. β細胞內鈣離子的濃度升高與胰島素從分泌囊泡中釋放的作用有關